關於肺膿瘍（lung abscess）的手術治療適應症不包括下列何者？
A. 併發支氣管肋膜瘻管（broncho-pleural fistula）
B. 大量咳血
C. 持續大量膿痰
D. 懷疑合併肺癌

正確答案：C. 持續大量膿痰